Clinical trial exclusion criterion:
Patients with active illicit drug dependence

Annotated entities:
- Condition: "illicit drug dependence"